Clinically significant disease defined as at least 1 painful episode per year averaged over the previous 3 years or a history of priapism, stroke, acute chest syndrome, avascular necrosis, multi-organ failure or the need for chronic narcotic medications for pain from sickle cell disease

The above is a clinical trial inclusion criterion. Annotated with entity spans:
[Condition: Clinically significant disease] defined as at least 1 [Condition: painful episode] [Multiplier: per year averaged over the previous 3 years] or a [Temporal: history] of [Condition: priapism], [Condition: stroke], [Condition: acute chest syndrome], [Condition: avascular necrosis], [Condition: multi-organ failure] or the [Mood: need for] [Multiplier: chronic] [Drug: narcotic medications] for [Condition: pain] from [Condition: sickle cell disease]